Inability to understand and comply with the instructions of the study

The above is a clinical trial exclusion criterion. Annotated with entity spans:
[Non-query-able: Inability to understand and comply with the instructions of the study]